一位 60 歲男性，因腹部腫脹住院，檢查有腹水而做診斷性引流，結果白血球數為 300/mm3，其中 polymorphonuclear 細胞占 35％，蛋白值為 2.0 g/dL，白蛋白值為 1.2 g/dL；血清白蛋白值為 2.6 g/dL，以下之診斷那一項最可能？
A. 心臟衰竭
B. 結核性腹膜炎
C. 腹膜癌症
D. 細菌性腹膜炎

正確答案：A. 心臟衰竭